Pertenece a la membrana interna mitocondrial:
1. Monoaminooxidasas.
2. Porinas.
3. Enzimas solubles del ciclo de Krebs.
4. Citocromo.

Respuesta correcta: 4. Citocromo.